Willing to receive the unlicensed vaccine given as an IM injection

The above is a clinical trial inclusion criterion. Annotated with entity spans:
[Non-query-able: Willing to receive the unlicensed vaccine given as an IM injection]